下列有關醫療市場的特性，何者是最適當的組合關係？①異於一般市場，具有非市場性 ②需求和供給各有其特性，並不同於一般商品之交易 ③價格是由需求和供給之關係決定 ④醫療需求者無法預知價格而成為價格之接受者 ⑤醫療提供者處於賣方居於優勢主導之形勢
A. ①②③④⑤
B. ②③④⑤
C. ①②③④
D. ①②④⑤

正確答案：D. ①②④⑤